3. Male or female with a diagnosis of PBC, by at least two of the following criteria:

The above is a clinical trial inclusion criterion. Annotated with entity spans:
[Parsing_Error: 3.] [Person: Male] or [Person: female] with a diagnosis of [Condition: PBC], by [Multiplier: at least two] of the [Parsing_Error: following criteria]: